Clinical trial exclusion criterion:
Positive alcohol (breath test) or nicotine screen at Screening Visit or Day 1 (positive nicotine screen does not apply to heterozygous cohort).

Entity relations:
- Has_value("alcohol test", "Positive")
- Has_value("nicotine screen", "Positive")
- Has_index("at Screening Visit", "Screening Visit")
- Has_temporal("nicotine screen", "at Screening Visit")
- OR("alcohol test", "breath test")